Which methods exist for efficient calculation of Elementary flux modes (EFMs) in genome-scale metabolic networks (GSMNs)?

The efficient calculation of elementary flux modes (EFMs) in genome-scale metabolic networks (GSMNs) is still a challenge. EFM-ta and treeefm are two different algorithms that use linear programming-based tree search and efficiently enumerates a subset of EFMs in GSMNs.